children and teenagers aged less than 20 years,

The above is a clinical trial inclusion criterion. Annotated with entity spans:
[Person: children] and [Person: teenagers] [Person: aged] [Value: less than 20 years],